Una persona que presenta en orina una [Urea] elevada, posiblemente lleva una dieta:
1. Muy baja en hidratos de carbono y muy elevada en proteínas.
2. Muy elevada en grasas y baja en proteínas.
3. Equilibrada excepto en hidratos de carbono.
4. Moderada en hidratos de carbono y equilibrada en grasas y proteínas.
5. Muy alta en hidratos de carbono y muy baja en proteínas.

Respuesta correcta: 1. Muy baja en hidratos de carbono y muy elevada en proteínas.